下列關於水痘（varicella）的敘述，何者為非？
A. 年齡較大之青少年及青年罹患，其症狀及併發症會比小孩輕微
B. 皮膚、軟組織細菌感染是最常見的併發症
C. 免疫缺損的患者會出現重症水痘
D. 懷孕前 20 週罹患水痘，可能會發生先天性畸形

正確答案：A. 年齡較大之青少年及青年罹患，其症狀及併發症會比小孩輕微